Clinical trial inclusion criteria:
systolic blood pressure between 140-160 mmHG
between 18-80 years old

Annotated entities:
- Measurement: "systolic blood pressure"
- Value: "between 140-160 mmHG"
- Value: "between 18-80 years"
- Person: "old"